病人接受全身麻醉行胸腰脊椎側彎（scoliosis）矯正手術，麻醉醫師術中施行清醒測試（wake-up test），其目的為測試病人的何種神經功能？
A. 下肢感覺功能
B. 上肢運動功能
C. 下肢運動功能
D. 上肢感覺功能

正確答案：C. 下肢運動功能